Clinical trial inclusion criterion:
capable of making their own decisions

Annotated entities:
- Post-eligibility: "capable of making their own decisions"